下列那一種影像診斷技術在妊娠期間最常使用？
A. 腹部超音波（abdominal ultrasonography）
B. 電腦斷層掃描（computed tomography）
C. 內視鏡（endoscopy）
D. 核磁共振影像（magnetic resonance imaging）

正確答案：A. 腹部超音波（abdominal ultrasonography）